Females of childbearing potential: negative serum or urine pregnancy test

The above is a clinical trial inclusion criterion. Annotated with entity spans:
[Person: Females] of [Condition: childbearing potential]: [Value: negative] [Measurement: serum] or [Measurement: urine pregnancy test]